有關神經細胞膜產生動作電位（action potential）之敘述，下列何者不正確？
A. 骨骼肌細胞上之鈉離子孔道（Na channels）在胞膜去極化（depolarization）後，極易進入不活化狀態（inactivated state）
B. 動作電位不反應期（refractory period）部分是由鈉離子孔道之啟閉狀態（gating status）所決定
C. 動作電位之後過極化期（after-hyperpolarization）主要是由鈉離子孔道之啟閉狀態所決定
D. 鈉離子孔道之啟閉狀態會受到神經細胞靜止膜電位（resting membrane potential）之影響

正確答案：C. 動作電位之後過極化期（after-hyperpolarization）主要是由鈉離子孔道之啟閉狀態所決定